24歲的婦女，在門診時被發現大陰唇有一小於1公分但突起的小腫瘤，經切片檢查後，最有可能的診斷為：
A. 原位癌（carcinoma in situ）
B. 黑色素腫瘤（melanoma）
C. 上皮內包性囊腫（epidermal inclusion cyst）
D. 管腺瘤（hidradenoma）

正確答案：C. 上皮內包性囊腫（epidermal inclusion cyst）